Where can we find the protein dermcidin?

In previous work we reported the expression of Y-P30 \/ dermcidin in maternal peripheral blood mononuclear cells and the transport of the protein to the fetal brain. In this study we analyzed hormonal regulation of Y-P30 in human immune cells and expression of Y-P30 in the placenta. This article provides an overview on the identification, activity, 3D structure, and mechanism of action of human AMPs selected from the antimicrobial peptide database. the discovery of dermcidin-derived antimicrobial peptides in eccrine sweat demonstrated that sweat actively participates in the constitutive innate immune defense of human skin against infection. Several reports also state that peptides processed from the dermcidin precursor protein exhibit a range of other biological functions in neuronal and cancer cells. Using an immunoaffinity approach followed by multipoint validation, we identified the target of seriniquinone as the small protein, dermcidin. Hypertension and diabetes mellitus are considered to be two major atherosclerotic risk factors for coronary artery disease. ``Pustulosis palmaris et plantaris'', or palmoplantar pustulosis, is a chronic pustular dermatitis characterized by intraepidermal palmoplantar pustules. Semi-quantitative dot-blot analysis revealed higher concentrations of hCAP-18 \/ LL-37 in PPP-VF compared to healthy sweat. In conclusion, the expression of various AMPs is altered in acne vulgaris.